下列何種藥物已被美國FDA認可用於治療嗜睡症（narcolepsy）？
A. clozapine
B. lorazepam
C. lithium
D. modafinil

正確答案：D. modafinil